Be an experienced opioid user, defined as any subject treated with opioid therapy, equivalent or equal to >20 mg per day of morphine, for a period of 3 consecutive days immediately prior to first day of dosing.

The above is a clinical trial inclusion criterion. Annotated with entity spans:
Be an experienced opioid user, defined as any subject treated with [Drug: opioid therapy], [Qualifier: equivalent] or equal to [Multiplier: >20 mg per day] of [Drug: morphine], for a period of [Temporal: 3 consecutive days immediately prior to first day of dosing].